¿Qué estrategias de muestreo podemos utilizar cuando llevamos a cabo una observación?
1. La de “intervalo total”, que implica que no se registra la conducta si no se produce en el total del intervalo fijado.
2. La de “intervalo parcial”, que implica que no se registra la conducta si no se produce en el total de intervalo fijado.
3. La de “muestras momentáneas”, que implica que no se registra la conducta si no se produce en el total del intervalo fijado.
4. La de “intervalo substractivo”, que implica que el observador anota toda conducta que ocurre en una fracción del intervalo de observación.
5. La de “intervalo parcial”, que implica que tan sólo se registran conductas que aparecen en un momento predeterminado del intervalo de observación.

Respuesta correcta: 1. La de “intervalo total”, que implica que no se registra la conducta si no se produce en el total del intervalo fijado.